What is FeatureCounts used for?

featureCounts: an efficient general purpose program for assigning sequence reads to genomic features.